Patients taking antipsychotics, mood stabilizer or any psychotropic medications besides antidepressants, except benzodiazepines or beta blockers or hypnotics

The above is a clinical trial exclusion criterion. Annotated with entity spans:
Patients taking [Drug: antipsychotics], [Drug: mood stabilizer] or any [Drug: psychotropic medications] [Negation: besides] [Drug: antidepressants], [Negation: except] [Drug: benzodiazepines] or [Drug: beta blockers] or [Drug: hypnotics]